Clinical trial inclusion criterion:
Surgery scheduled to last at least 2 hours (including time for anesthesia induction, etc)

Entity relations:
- Has_qualifier("Surgery", "scheduled to last at least 2 hours")